2.6mmol/L (100mg/dl)=LDL-C=5.2mmol/L (200mg/dl), and TG<5.7mmol/L (500mg/dl);

The above is a clinical trial inclusion criterion. Annotated with entity spans:
[Value: 2.6mmol/L] ([Value: 100mg/dl])=[Measurement: LDL-C]=[Value: 5.2mmol/L] ([Value: 200mg/dl]), and [Measurement: TG][Value: <5.7mmol/L] ([Value: 500mg/dl]);